Clinical trial exclusion criterion:
Patients who received anti-hair loss treatment within the past six months.

Annotated entities:
- Procedure: "anti-hair loss treatment"
- Temporal: "within the past six months"